Subjects who have received live or live attenuated vaccines within 6 weeks prior to the first dose of study drug (or the zoster vaccine)

The above is a clinical trial exclusion criterion. Annotated with entity spans:
Subjects who have received [Drug: live] or [Drug: live attenuated vaccines] [Temporal: within 6 weeks prior to the first dose of study drug] (or the [Drug: zoster vaccine])